Clinical trial exclusion criterion:
Purulent infection

Annotated entities:
- Condition: "Purulent infection"